下列何種免疫調節劑是影響到所有活化的淋巴球，及作用於其他所有正在分裂的細胞，而並非僅限於適應性免疫反應（adaptive immune responses）的調節及抑制？
A. mycophenolate
B. cyclosporine A
C. rapamycin（sirolimus）
D. tacrolimus（FK-506）

正確答案：A. mycophenolate